Periodontal sites that presented bleeding during crevicular fluid collection or sites that prevent proper collection of clinical parameters.

The above is a clinical trial exclusion criterion. Annotated with entity spans:
[Non-representable: Periodontal sites that presented bleeding during crevicular fluid collection or sites that prevent proper collection of clinical parameters.]